Age between 0 and 18 years

The above is a clinical trial inclusion criterion. Annotated with entity spans:
[Person: Age] [Value: between 0 and 18 years]